Clinical trial exclusion criteria:
Signs of hemodynamic instability (i.e. systolic blood pressure <100 mm Hg.St. or episode of systolic blood pressure fall for =40 mm Hg. / or heart rate > 110 lasting more than 15 min) or need for ventilatory support within 12 hours prior to randomisation.
The indication for oral anticoagulation, associated with others disease.
malignant neoplasm of any location
Contraindications to warfarin or pradaxa according to Russian Instructions for medical use of these drugs
Indications for concomitant treatment with antiplatelet agents
Any stroke within 6 months before randomization
Intracranial hemorrhage in anamnesis
Active bleeding, bleeding diathesis.
Clinically significant bleeding within the last 30 days.
Trauma or extensive surgery within 1 month before randomization or surgery planned in the next 6 months after randomization.
Intracranial pathology: tumor, arteriovenous fistula or aneurysm.
Gastrointestinal bleeding in the previous 3 months.
Gastric ulcer or duodenal ulcer with clinical manifestations or endoscopically identified acute ulcer without signs of scarring during previous 30 days.
Uncontrolled hypertension (systolic blood pressure> 180 mm Hg. and / or diastolic blood pressure> 100 mm.hg in patients receiving antihypertensive drugs).
Pregnancy, lactation.
Life expectancy <6 months.
Clinically significant liver disease.
Creatinine clearance (estimated by Cockcroft-Gault) <30 ml / min.
hemoglobin level <90 g/l), thrombocytopenia <100x10^9 / L.
Patients who, in the opinion of the researcher, are not suitable for inclusion in the study, for example, due to the low likelihood of doctor's recommendations following.
Long-term use of NSAIDs
Current participation in another clinical study.
Allergic to contrast substance or radioisotope drugs used in procedures to assess endpoints of the study, which according to researchers, may be a contraindication to the implementation of these research methods.

Annotated entities:
- Condition: "hemodynamic instability"
- Measurement: "systolic blood pressure"
- Value: "<100 mm Hg.St."
- Measurement: "systolic blood pressure fall"
- Value: "=40 mm Hg"
- Measurement: "heart rate"
- Value: "> 110"
- Multiplier: "lasting more than 15 min"
- Procedure: "ventilatory support"
- Mood: "need for"
- Temporal: "within 12 hours prior to randomisation"
- Procedure: "oral anticoagulation"
- Mood: "indication for"
- Qualifier: "malignant"
- Condition: "neoplasm"
- Condition: "Contraindications"
- Drug: "warfarin"
- Drug: "pradaxa"
- Qualifier: "Russian Instructions for medical use"
- Drug: "antiplatelet agents"
- Temporal: "concomitant"
- Mood: "Indications"
- Condition: "stroke"
- Temporal: "within 6 months before randomization"
- Condition: "Intracranial hemorrhage"
- Procedure: "anamnesis"
- Condition: "bleeding"
- Condition: "bleeding diathesis"
- Qualifier: "Active"
- Qualifier: "Clinically significant"
- Condition: "bleeding"
- Temporal: "within the last 30 days"
- Condition: "Trauma"
- Procedure: "extensive surgery"
- Temporal: "within 1 month before randomization"
- Procedure: "surgery"
- Mood: "planned"
- Temporal: "in the next 6 months after randomization"
- Condition: "Intracranial pathology"
- Condition: "tumor"
- Condition: "arteriovenous fistula"
- Condition: "aneurysm"
- Condition: "Gastrointestinal bleeding"
- Temporal: "in the previous 3 months"
- Condition: "Gastric ulcer"
- Condition: "duodenal ulcer"
- Condition: "clinical manifestations"
- Qualifier: "endoscopically identified"
- Procedure: "endoscopically"
- Condition: "acute ulcer"
- Negation: "without"
- Condition: "signs of scarring"
- Temporal: "during previous 30 days"
- Qualifier: "Uncontrolled"
- Condition: "hypertension"
- Measurement: "systolic blood pressure"
- Value: "> 180 mm Hg"
- Measurement: "diastolic blood pressure"
- Value: "> 100 mm.hg"
- Drug: "antihypertensive drugs"
- Condition: "Pregnancy"
- Condition: "lactation"
- Observation: "Life expectancy"
- Value: "<6 months"
- Qualifier: "Clinically significant"
- Condition: "liver disease"
- Measurement: "Creatinine clearance"
- Qualifier: "Cockcroft-Gault"
- Value: "<30 ml / min"
- Measurement: "hemoglobin level"
- Value: "<90 g/l"
- Condition: "thrombocytopenia"
- Value: "<100x10^9 / L"
- Non-query-able: "Patients who, in the opinion of the researcher, are not suitable for inclusion in the study, for example, due to the low likelihood of doctor's recommendations following."
- Drug: "NSAIDs"
- Multiplier: "Long-term use"
- Non-query-able: "Current participation in another clinical study."
- Condition: "Allergic"
- Drug: "contrast substance"
- Drug: "radioisotope drugs"